Patients are able to provide signed and dated written informed consent prior to any study specific procedures.

The above is a clinical trial inclusion criterion. Annotated with entity spans:
[Informed_consent: Patients are able to provide signed and dated written informed consent prior to any study specific procedures.]